Clinical trial exclusion criterion:
Major congenital defects or serious chronic illness.

Annotated entities:
- Condition: "Major congenital defects"
- Condition: "serious chronic illness"